28 歲女性患者，因長期腹瀉求診，被懷疑是「分泌性腹瀉」。下列有關「分泌性腹瀉」的敘述，何者錯誤？
A. 通常在禁食以後，仍然會發生下痢
B. 有時在病人身體內長有內分泌腫瘤
C. 可能與某些細菌（如霍亂弧菌）感染有關
D. 與使用氧化鎂有關

正確答案：D. 與使用氧化鎂有關